¿Cuál de los siguientes tratamientos NO ha mostrado ser efectivo en el tratamiento de la esquizofrenia?
1. El tratamiento asertivo comunitario.
2. Procedimientos de empleo protegido para la rehabilitación laboral.
3. Los programas integrados de rehabilitación cognitiva.
4. La intervención familiar psicoeducativa.
5. La terapia psicoanalítica de tiempo limitado.

Respuesta correcta: 5. La terapia psicoanalítica de tiempo limitado.